Which enzyme does MLN4924 inhibit?

MLN4924 is  an investigational small molecule inhibitor of NEDD8-activating enzyme (NAE).